known or presumed abnormal coagulation status

The above is a clinical trial exclusion criterion. Annotated with entity spans:
[Qualifier: known] or [Qualifier: presumed] [Condition: abnormal coagulation status]